History of active rheumatic diseases

The above is a clinical trial exclusion criterion. Annotated with entity spans:
History of [Qualifier: active] [Condition: rheumatic diseases]